一位52歲患有高血壓並服用藥物的男性，計畫到印度鄉下去旅遊七天，若您要給他建議，下列何者不適當？
A. 高血壓藥可以不帶，因旅遊時間只有七天
B. 自備ciprofloxacin以治療旅程中可能發生的旅遊者腹瀉或泌尿道感染
C. 攜帶一些消炎止痛藥及抗組織胺以備不時之需
D. 飲食必需煮熟，煮開，剝皮，否則就不要吃

正確答案：A. 高血壓藥可以不帶，因旅遊時間只有七天